Ongoing treatment with analgesics

The above is a clinical trial inclusion criterion. Annotated with entity spans:
[Temporal: Ongoing] [Procedure: treatment] with [Drug: analgesics]